Abnormal Coagulation (INR>1.5<U+3001>APTT>1.5 UNL), with tendency of bleed;

The above is a clinical trial exclusion criterion. Annotated with entity spans:
[Condition: Abnormal Coagulation] ([Measurement: INR][Value: >1.5]<U+3001>[Measurement: APTT][Value: >1.5 UNL]), with [Condition: tendency of bleed];